Have participated in an interventional, medical, surgical, or pharmaceutical study within 30 days of screening.

The above is a clinical trial exclusion criterion. Annotated with entity spans:
Have participated in an [Observation: interventional], [Observation: medical], [Observation: surgical], or [Observation: pharmaceutical study] [Temporal: within 30 days of screening].